The protein NONO forms heterodimers. With which proteins?

The protein NONO forms heterodimers with PSPC1, SFPQ.